La biotina es un transportador de:
1. CO2.
2. Fosforilo.
3. Acilo.
4. Metilo.
5. Electrones.

Respuesta correcta: 1. CO2.